Clinical trial exclusion criterion:
previous OHSS

Annotated entities:
- Condition: "OHSS"
- Temporal: "previous"